Clinical trial exclusion criterion:
Nitroglycerin usage or nitrates and use of phosphodiesterase 5 (PDE5) inhibitors

Entity relations:
- OR("Nitroglycerin", "nitrates")